Clinical trial inclusion criterion:
Current HAMD-17 score = 20 and the duration of the index episode is greater than or equal to four weeks.

Entity relations:
- Has_value("HAMD-17", "score = 20")
- Has_temporal("HAMD-17", "Current")
- Has_temporal("index episode", "greater than or equal to four weeks")